Clinical trial exclusion criterion:
Treatment with any therapeutically dosed anticoagulant for more than 48 hours prior to enrolment

Entity relations:
- Has_qualifier("anticoagulant", "therapeutically")
- Has_index("more than 48 hours prior to enrolment", "enrolment")
- Has_temporal("anticoagulant", "more than 48 hours prior to enrolment")